Nursing homes will be eligible to participate if they meet the following criteria:

The above is a clinical trial inclusion criterion. Annotated with entity spans:
[Visit: Nursing homes] will be eligible to participate if they meet the following criteria: